Clinical trial exclusion criterion:
If immunodepression is present

Annotated entities:
- Condition: "immunodepression"